Clinical trial exclusion criterion:
Presence of any infertility factor other than anovulatory PCOS.

Annotated entities:
- Condition: "infertility factor"
- Negation: "other than"
- Condition: "anovulatory PCOS"